Patients with persistent stone burden following definitive surgical therapy.

The above is a clinical trial exclusion criterion. Annotated with entity spans:
Patients with [Qualifier: persistent] [Observation: stone burden] [Temporal: following definitive surgical therapy].